造成旅行者腹瀉（traveler's diarrhea）的致病原中較不常見的是下列何者？
A. 大腸桿菌
B. Salmonella 和 Shigella
C. Rotavirus 和 Norwalk-like virus
D. Cyclospora 和 Giardia lamblia

正確答案：D. Cyclospora 和 Giardia lamblia